有關膝關節內之半月板（meniscus）的特性，下列何者錯誤？
A. 它們協助承載體重，也增加了股骨脛骨間之吻合度（congruency）
B. 提供膝關節本體位覺（proprioceptive）訊息，幫助關節之運動功能
C. 通常內側半月板比起外側半月板較為彎曲，也覆蓋較大部分的脛骨平臺（tibial plateau）之面積
D. 半月板（menisus）之white-white zone血液灌注差，破裂時即使加以縫合癒合能力亦很差

正確答案：C. 通常內側半月板比起外側半月板較為彎曲，也覆蓋較大部分的脛骨平臺（tibial plateau）之面積